Clinical trial inclusion criterion:
Not pregnant at the time of enrollment

Annotated entities:
- Negation: "Not"
- Condition: "pregnant"
- Temporal: "at the time of enrollment"